下列何者有同行的動脈可幫助髖關節的血液供應？
A. 股骨頭韌帶（ligament of head of femur）
B. 髖臼橫韌帶（transverse acetabular ligament）
C. 髂股韌帶（iliofemoral ligament）
D. 恥股韌帶（pubofemoral ligament）

正確答案：A. 股骨頭韌帶（ligament of head of femur）